Clinical trial inclusion criterion:
Patient not able to receive 12 months of dual anti-platelet therapy

Annotated entities:
- Condition: "able to receive"
- Procedure: "dual anti-platelet therapy"
- Temporal: "12 months"